一位 52 歲急性肺炎患者住院治療，臥床 7 天後發生右下肢 proximal deep vein thrombosis，給予 heparin 併 warfarin 治療後略有改善。該患者出院後口服抗凝血劑 warfarin 至少應給多長？
A. 4 週
B. 3 個月
C. 6 個月
D. 12 個月

正確答案：B. 3 個月